下列何種處置對全身性過敏反應（Systemic anaphylaxis）的急性期治療最有幫助？
A. 類固醇的靜脈注射
B. β-blocker 的投予
C. muscle relaxant 的肌肉注射
D. Epinephrine 的皮下注射

正確答案：D. Epinephrine 的皮下注射